Clinical trial inclusion criterion:
Greater than 34 weeks gestation

Entity relations:
- Has_value("gestation", "Greater than 34 weeks")